李先生抽菸近二十年，預計在一個月內採取行動來戒菸，李先生的行為是在跨越理論模式中的那個階段？
A. 沉思階段
B. 準備階段
C. 行動階段
D. 維持階段

正確答案：B. 準備階段